Clinical trial inclusion criterion:
clinical data is complete.

Annotated entities:
- Non-query-able: "clinical data is complete."